Previous surgical management of ovarian pathology

The above is a clinical trial exclusion criterion. Annotated with entity spans:
[Temporal: Previous] [Procedure: surgical management] of [Condition: ovarian pathology]